List representatives of the major fungal hypoxanthine-adenine-guanine transporter families.

AzgA and Fcy21p are prototypes of the two major fungal hypoxanthine-adenine-guanine transporter families.